7. Platelet count < 100,000

The above is a clinical trial exclusion criterion. Annotated with entity spans:
[Parsing_Error: 7.] [Measurement: Platelet count] [Value: < 100,000]